Clinical trial exclusion criterion:
Any other illness or infection (latent or active) that, in the Investigator's opinion, could be exacerbated by study medication

Annotated entities:
- Condition: "illness"
- Condition: "infection"
- Qualifier: "latent"
- Qualifier: "active"
- Temporal: "active"
- Non-representable: "in the Investigator's opinion"
- Qualifier: "exacerbated by study medication"
- Drug: "study medication"